某科技公司主管林先生於二週前赴美國紐澤西地區參訪旅遊，旅遊期間曾遭受不知名具有八隻腳蟲體叮咬，回國一週後出現發燒、寒顫、頭痛及肌痛等症狀，經醫院檢	結果發現血小板減少、輕度溶血性貧血及紅血球內發現有雙核形（binucleateform）之寄生蟲。依據上述結果，林先生最可能感染何種寄生蟲病？
A. 萊姆病（Lyme disease）
B. 巴貝氏原蟲症（babesiosis）
C. 恙蟲病（scrub typhus）
D. 艾立克次體症（ehrlichiosis）

正確答案：B. 巴貝氏原蟲症（babesiosis）